Clinical trial exclusion criterion:
Persistent, unresolved NCI CTCAE v4.0 ≥ Grade 2, previous drug-related toxicity (except alopecia, erectile impotence, hot flashes, libido, neuropathy).

Entity relations:
- Has_value("NCI CTCAE v4.0", "≥ Grade 2")
- Has_negation("alopecia", "except")
- Has_temporal("drug-related toxicity", "previous")
- OR("alopecia", "libido", "hot flashes", "erectile impotence", "neuropathy")